Clinical trial exclusion criterion:
Bloodpressure 150/95 or higher.

Annotated entities:
- Measurement: "Bloodpressure"
- Value: "150/95 or higher"